1. History of uncontrolled hypertension

The above is a clinical trial exclusion criterion. Annotated with entity spans:
[Parsing_Error: 1.] [Temporal: History] of [Qualifier: uncontrolled] [Condition: hypertension]